Has known active central nervous system(CNS) metastases

The above is a clinical trial exclusion criterion. Annotated with entity spans:
Has known active [Qualifier: central nervous system]([Qualifier: CNS]) [Condition: metastases]